Person who is participating in another study or intends to participate in another study during this study duration.

The above is a clinical trial exclusion criterion. Annotated with entity spans:
[Competing_trial: Person who is participating in another study or intends to participate in another study during this study duration.]